Clinical trial inclusion criterion:
Existence of a contraceptive method for women of child-bearing age

Entity relations:
- AND("women", "age")
- Has_value("age", "child-bearing")
- AND("women", "contraceptive method")